Clinical trial exclusion criterion:
5. History of major head trauma;

Entity relations:
- Has_temporal("major head trauma", "History")